Clinical trial inclusion criterion:
mean blood pressure more than 60mmHg

Annotated entities:
- Measurement: "mean blood pressure"
- Value: "more than 60mmHg"